Durante el proceso de envejecimiento se producen cambios en los diferentes sistemas y aparatos siendo cierto que en el sistema cardiovascular:
1. El aumento de la sensibilidad de los barorreceptores intensifica la hipotensión postural.
2. Las tres capas de los vasos sanguíneos se ven afectadas por igual en el proceso de envejecimiento.
3. El ventrículo izquierdo disminuye de tamaño.
4. El ciclo de llenado diastólico y vaciado sistólico requiere menos tiempo para completarse.
5. Las válvulas aurículoventriculares sufren esclerosis y fibrosis.

Respuesta correcta: 5. Las válvulas aurículoventriculares sufren esclerosis y fibrosis.